Clinical trial exclusion criterion:
Known allergy or intolerance to any of the study medications.

Entity relations:
- AND("allergy", "study medications")
- OR("allergy", "intolerance")